Clinical trial inclusion criterion:
Positive ANA OR anti-dsDNA within one year of screening

Entity relations:
- Has_index("within one year of screening", "screening")
- Has_value("ANA", "Positive")
- Has_value("anti-dsDNA", "Positive")
- Has_temporal("anti-dsDNA", "within one year of screening")
- Has_temporal("ANA", "within one year of screening")
- OR("ANA", "anti-dsDNA")